Una de las características del Proceso de Enfermería es:
1. La toma de decisiones es característica de la etapa de planificación.
2. Se centra en la enfermera.
3. Los datos de cada fase proporcionan información para la siguiente.
4. La toma de decisiones debe estar ligada a respuesta estándar.
5. Debe diseñarse de manera que permanezca estático.

Respuesta correcta: 3. Los datos de cada fase proporcionan información para la siguiente.